Strenuous physical exercise within 3 hours of Visit 1 (Screening)

The above is a clinical trial exclusion criterion. Annotated with entity spans:
[Condition: Strenuous physical exercise] [Temporal: within 3 hours of Visit 1 (Screening)]